History of any reaction or hypersensitivity likely to be exacerbated by any component of the vaccines.

The above is a clinical trial exclusion criterion. Annotated with entity spans:
History of any [Condition: reaction] or [Condition: hypersensitivity] [Qualifier: likely to be exacerbated by any component of the vaccines].